Clinical trial exclusion criterion:
Inability to exercise or undertake a MRP

Annotated entities:
- Observation: "exercise"
- Procedure: "MRP"
- Negation: "Inability"